3. local steroid injection within 6 weeks or physical therapy within 4 weeks

The above is a clinical trial exclusion criterion. Annotated with entity spans:
3. [Procedure: local steroid injection] [Temporal: within 6 weeks] or [Procedure: physical therapy] [Temporal: within 4 weeks]